食道癌最常見的臨床狀況為何？
A. 發燒
B. 胸痛
C. 漸行性吞嚥困難
D. 食道逆流

正確答案：C. 漸行性吞嚥困難